Clinical trial exclusion criterion:
Inability to provide an informed consent

Annotated entities:
- Non-query-able: "Inability to provide an informed consent"